History of claustrophobia

The above is a clinical trial exclusion criterion. Annotated with entity spans:
[Temporal: History] of [Condition: claustrophobia]